¿Cuál de las siguientes moléculas presenta el nº más alto de electrones antienlazantes?
1. B2.
2. N 2.
3. Li2.
4. F 2.
5. O 2.

Respuesta correcta: 4. F 2.